Clinical trial exclusion criterion:
baseline systolic blood pressure (SBP) < 100 mmHg

Entity relations:
- Subsumes("systolic blood pressure", "SBP")
- Has_value("systolic blood pressure", "< 100 mmHg")
- Has_temporal("systolic blood pressure", "baseline")